一名患者 2 週前接受陰道全子宮切除、膀胱修補及尿失禁手術（Burch），回到門診時主訴有持續漏尿現象，她並沒有尿急或解尿疼痛。她最可能發生下列那一種情形？
A. 泌尿道感染
B. 膀胱陰道管
C. 膀胱不穩定（detrusor instability）
D. 神經性膀胱

正確答案：B. 膀胱陰道管